Clinical trial exclusion criteria:
Age less than one year or age greater than/equals to 18 years
Previous treatment with cytotoxic agents or high-dose steroids
Mixed phenotype acute leukemia (MPAL)
ALL as secondary malignancy
Abnormal renal or liver function
Doubtful compliance or unable to afford full course of therapy

Annotated entities:
- Person: "Age"
- Value: "less than one year"
- Value: "greater than/equals to 18 years"
- Person: "age"
- Temporal: "Previous"
- Procedure: "treatment"
- Drug: "cytotoxic agents"
- Drug: "high-dose steroids"
- Condition: "Mixed phenotype acute leukemia"
- Condition: "MPAL"
- Condition: "ALL"
- Qualifier: "secondary"
- Condition: "malignancy"
- Condition: "Abnormal liver function"
- Condition: "Abnormal renal function"
- Observation: "Doubtful compliance"
- Observation: "unable to afford full course of therapy"